Clinical trial exclusion criterion:
Ongoing treatment with cyclosporine within 2 weeks;

Annotated entities:
- Drug: "cyclosporine"
- Procedure: "treatment"
- Temporal: "Ongoing"
- Temporal: "within 2 weeks"